What does a PET (Positron Excitation Tomography) measure?

Positron emission tomography (PET) is used to measure differences in metabolism in different tissues.